正常人血中濃度最高的抗體為：
A. IgM
B. IgG
C. IgA
D. IgE

正確答案：B. IgG